在呼吸訓練中，圓唇吐氣（purse-lip），可以達到下列何種作用？
A. 排除蓄痰
B. 增加運動耐力
C. 預防小支氣管的塌陷
D. 增加呼吸肌肌力

正確答案：C. 預防小支氣管的塌陷